Clinical trial exclusion criterion:
Currently meet Diagnostic and Statistical Manual of Mental Disorders - Fifth Edition (DSM-5) criteria for substance use disorder, or history thereof, within 12 months before dosing.

Entity relations:
- Has_temporal("substance use disorder", "within 12 months")
- Subsumes("Diagnostic and Statistical Manual of Mental Disorders - Fifth Edition", "DSM-5")
- AND("Diagnostic and Statistical Manual of Mental Disorders - Fifth Edition", "substance use disorder")